Clinical trial exclusion criterion:
Oral corticosteroids at a dose >40 mg prednisone or its equivalent per day; receipt of cyclosporine, tacrolimus, sirolimus, or mycophenolate mofetil within 8 weeks before the first study agent injection; or use of an investigational agent within 5 half-lives of that agent before the first study agent injection.

Entity relations:
- Has_multiplier("Oral corticosteroids", ">40 mg prednisone per day")
- Has_temporal("cyclosporine", "within 8 weeks before the first study agent injection")
- Has_temporal("investigational agent", "within 5 half-lives")
- Has_temporal("investigational agent", "before the first study agent injection")
- OR("cyclosporine", "sirolimus", "tacrolimus", "mycophenolate mofetil")
- OR("Oral corticosteroids", "cyclosporine", "investigational agent")